Patients with T2DM and CAS as defined below:

The above is a clinical trial inclusion criterion. Annotated with entity spans:
Patients with [Condition: T2DM] and [Condition: CAS] as defined below: